Clinical trial exclusion criterion:
Serum bilirubin > 5.0mg/dl

Annotated entities:
- Measurement: "Serum bilirubin"
- Value: "> 5.0mg/d"